In what year did Gregor Mendel die?

Gregor Mendel, OSA (1822-1884), founder of scientific genetics.